Clinical trial exclusion criteria:
Pre-existing hemoptysis of a severity > grade 3 by NCI CTCAE criteria within 4 weeks prior to study entry
Uncontrolled hypertension
CHF, angina or arrhythmias
LVEF < 1 UNL
Existing a second malignancy within 5 years
Infected with HIV

Annotated entities:
- Condition: "hemoptysis"
- Qualifier: "severity"
- Value: "> grade 3"
- Measurement: "NCI CTCAE criteria"
- Temporal: "within 4 weeks prior to study entry"
- Reference_point: "study entry"
- Condition: "hypertension"
- Qualifier: "Uncontrolled"
- Condition: "CHF"
- Condition: "angina"
- Condition: "arrhythmias"
- Measurement: "LVEF"
- Value: "< 1 UNL"
- Condition: "second malignancy"
- Temporal: "within 5 years"
- Undefined_semantics: "second malignancy"
- Condition: "HIV"